Which are the main advantages of kallisto against similar methodologies?

kallisto, an RNA-seq quantification program that is two orders of magnitude faster than previous approaches and achieves similar accuracy.